Chronic kidney disease (CrCl < 30ml/min)

The above is a clinical trial exclusion criterion. Annotated with entity spans:
[Condition: Chronic kidney disease] ([Measurement: CrCl] [Value: < 30ml/min])